La evaluación individual de la inteligencia presenta, frente a su evaluación colectiva, la siguiente ventaja:
1. La aplicación de los tests individuales conlleva una menor duración.
2. La evaluación individual requiere un menor adiestramiento del psicólogo que los administra (los colectivos requieren mayor pericia).
3. Ofrece una puntuación total sin pormenorizar en los distintos perfiles de habilidades.
4. Se considera más útil para un propósito clínico que la evaluación colectiva.
5. La evaluación individual no requiere control del tiempo.

Respuesta correcta: 4. Se considera más útil para un propósito clínico que la evaluación colectiva.